Age 65 - 79

The above is a clinical trial inclusion criterion. Annotated with entity spans:
[Person: Age] [Value: 65 - 79]